Clinical trial exclusion criterion:
4. Preexisting neurological disorders, dementia or previous stroke;

Entity relations:
- Has_temporal("stroke", "previous")
- Has_temporal("neurological disorders", "Preexisting")
- Has_temporal("dementia", "Preexisting")
- OR("neurological disorders", "stroke", "dementia")